Healthy subjects or subjects with well controlled underlying disease.

The above is a clinical trial inclusion criterion. Annotated with entity spans:
[Condition: Healthy] subjects or subjects with [Qualifier: well controlled] [Condition: underlying disease].